Clinical trial exclusion criterion:
20. History of allogeneic organ transplant

Annotated entities:
- Parsing_Error: "20."
- Procedure: "allogeneic organ transplant"
- Temporal: "History"